精索靜脈曲張（varicocele）好發於一側的原因是：
A. 左睪丸動脈源自主動脈
B. 右睪丸動脈源自主動脈
C. 左睪丸靜脈注入左腎靜脈
D. 右睪丸靜脈注入右腎靜脈

正確答案：C. 左睪丸靜脈注入左腎靜脈